How is Burke-Fahn-Marsden Dystonia scale used?

Burck-Fahn-Marsden Dystonia scale (BBS) is a simple, reliable, and valid measure of disease severity in patients with dystonia.